Able to communicate well with the investigator and comply with the requirements of the study.

The above is a clinical trial inclusion criterion. Annotated with entity spans:
[Observation: Able to communicate well] with the investigator and [Observation: comply with the requirements of the study].